¿Qué diseño de la Genética de la conducta permite aislar de forma más precisa los efectos ambientales de los efectos genéticos?:
1. Los estudios de adopciones.
2. Los estudios comparativos de gemelos monozigóticos y dizigóticos.
3. Los estudios de hermanos que viven juntos y separados.
4. Los estudios de grupos familiares que presentan distintos grados de parentesco.

Respuesta correcta: 1. Los estudios de adopciones.